Clinical trial exclusion criterion:
History of alcohol or drug abuse (as defined by the current version of the DSM) within 2 years before the first dose administration, or positive alcohol or drug screen.

Entity relations:
- AND("drug abuse", "current version of the DSM")
- AND("alcohol abuse", "current version of the DSM")
- Has_index("within 2 years before", "the first dose administration")
- Has_value("alcohol screen", "positive")
- Has_value("drug screen", "positive")
- Has_temporal("alcohol abuse", "History")
- Has_temporal("alcohol abuse", "within 2 years before")
- OR("alcohol abuse", "drug abuse")
- OR("alcohol abuse", "alcohol screen", "drug screen")